Clinical trial exclusion criterion:
Difficulty in communication due to language issues

Annotated entities:
- Condition: "Difficulty in communication"
- Condition: "language issues"